Una de las claves del funcionamiento del método de Solvay para la obtención de carbonato de sodio es:
1. La descomposición térmica del hidrogenocarbonato de amonio.
2. La precipitación del hidrogenocarbonato de sodio.
3. La reacción del CaCl2 con amoniaco.
4. La sublimación del CaCl2 al calentar carbonato de calcio con NaCl.

Respuesta correcta: 2. La precipitación del hidrogenocarbonato de sodio.